Urinary albumin/creatinine ratio higher than 3000 mg/g, at the baseline visit.

The above is a clinical trial exclusion criterion. Annotated with entity spans:
[Measurement: Urinary albumin/creatinine ratio] [Value: higher than 3000 mg/g], [Temporal: at the baseline visit].